Clinical trial inclusion criterion:
Understand and communicate with the investigator, comply with the requirements of the study and give a written, signed and dated informed consent

Annotated entities:
- Informed_consent: "Understand and communicate with the investigator, comply with the requirements of the study and give a written, signed and dated informed consent"